3 -15 years old

The above is a clinical trial inclusion criterion. Annotated with entity spans:
[Value: 3 -15 years] [Person: old]